Los enantiómeros de una molécula son:
1. Muy distintos en todas sus propiedades químicas y físicas.
2. Imágenes especulares superponibles.
3. Distinguibles por su actividad óptica.
4. El resultado de la ciclación de una molécula en distintas posiciones.
5. Interconvertibles sin ruptura de enlaces covalentes.

Respuesta correcta: 3. Distinguibles por su actividad óptica.